Clinical trial exclusion criterion:
allergic to GLP-1 receptor agonist

Entity relations:
- AND("allergic", "GLP-1 receptor agonist")